Allergic to studied drugs or metal materials.

The above is a clinical trial exclusion criterion. Annotated with entity spans:
[Condition: Allergic] to [Drug: studied drugs] or metal materials.